Clinical trial exclusion criterion:
platelet count <50,000/ µL

Entity relations:
- Has_value("platelet count", "<50,000/ µL")